El complejo mitocondrial α-cetoglutarato deshidrogenasa necesita todos los compuestos siguientes EXEPTO:
1. CoA.
2. FAD.
3. NAD+.
4. NADP+.
5. Tiamina pirofosfato.

Respuesta correcta: 4. NADP+.